Scheduled to electively undergo open-laparotomy.

The above is a clinical trial inclusion criterion. Annotated with entity spans:
[Mood: Scheduled] to [Mood: electively] undergo [Procedure: open-laparotomy].